The NoSAS Score can be used for screening of which disorders?

The NoSAS score can be used for screening of obstructive sleep apnea syndrome, Sleep-Disordered Breathing and obstructive sleep apnea-hypopnea syndrome.